一位孕婦在懷孕第三十八週復發第二型疱疹病毒（HSV-2），處方藥為 Acyclovir，此藥之作用原理為：
A. 抑制病毒基因之核醣核酸（RNA）轉錄（transcription）
B. 抑制病毒基因之核醣核酸（RNA）之轉譯（translation）
C. 抑制病毒基因之去氧核醣核酸（DNA）之複製
D. 抑制病毒與宿主之直接結合（attachment）

正確答案：C. 抑制病毒基因之去氧核醣核酸（DNA）之複製